Clinical trial exclusion criterion:
Ongoing or active systemic infection, active hepatitis B or C virus infection, or known human immunodeficiency virus positive.

Annotated entities:
- Qualifier: "active"
- Temporal: "Ongoing"
- Condition: "systemic infection"
- Qualifier: "active"
- Condition: "hepatitis B virus infection"
- Condition: "C virus infection"
- Measurement: "human immunodeficiency virus"
- Value: "positive"